有關肌肉系統軟組織腫瘤的敘述，下列何者最正確？
A. 惡性橫紋肌肉瘤（rhabdomyosarcoma）通常為低惡性度的腫瘤且好發於成年人
B. 惡性脂肪肉瘤（liposarcoma）為高惡性度的腫瘤且好發於青少年
C. 滑液膜肉瘤（synovial sarcoma）可在 X 光攝影中發現部分鈣化
D. 類上皮肉瘤（epithelioid sarcoma）常見於骨盆腔或大腿深部肌肉組織中

正確答案：C. 滑液膜肉瘤（synovial sarcoma）可在 X 光攝影中發現部分鈣化